¿Qué trastorno de la personalidad se caracteriza por una pauta generalizada de indiferencia hacia las relaciones sociales y marco restringido de experiencia y expresión emocional?:
1. Esquizoide.
2. Límite.
3. Narcisista.
4. Antisocial.

Respuesta correcta: 1. Esquizoide.